下列有關低體溫症（hypothermia）會造成外科病患體內恆定的改變而發生危險的敘述，何者錯誤？
A. 增加 fibrinolytic activity
B. 血小板減少
C. 減少血小板的凝集功能
D. 減少血色素對氧氣的親和力

正確答案：D. 減少血色素對氧氣的親和力